在考慮進一步手術治療方式前，再仔細作超音波檢查，發現他的右心室發育不良，沒有心室中隔缺損，右心室竇（sinusoid）與左冠狀動脈有相通，作心導管檢查，右心室攝影時，顯影劑在心縮期，可進入左冠狀動脈，且看到左主冠狀動脈出口有狹窄。綜合這些檢查結果，那一種手術治療的方式最佳？
A. 肺動脈瓣切開術
B. Blalock-Taussig分流術
C. 利用體外循環幫忙，作跨肺動脈環部布塊（transannular patch）來擴大右心室出口徑
D. 肺動脈瓣切開術加Blalock-Taussig分流術

正確答案：B. Blalock-Taussig分流術